Gastrointestinal or genitourinary bleeding within the prior 3 months, or major surgery within 2 months.

The above is a clinical trial exclusion criterion. Annotated with entity spans:
[Condition: Gastrointestinal] or [Condition: genitourinary bleeding] [Temporal: within the prior 3 months], or [Procedure: major surgery] [Temporal: within 2 months].